一位 35 歲女性，抱怨長期有骨盆腔疼痛，因結婚三年不孕求診，子宮輸卵管攝影（HSG）見雙側輸卵管阻塞。下列敘述何者最正確？
A. 可能和過去骨盆腔炎次數與嚴重度有關
B. 子宮鏡檢較 HSG 詳細
C. 病人血清中披衣菌抗體不會增高
D. 此病患應考慮子宮腔內授精（IUI）

正確答案：A. 可能和過去骨盆腔炎次數與嚴重度有關